Clinical trial exclusion criteria:
Patients who have Tacrolimus trough level resulted as 2 ng/mg at the baseline.
Patients who are on steroid therapy due to positive result of acute rejection test before the baseline.
Patients who have received a transplant besides liver.
Patients who are allergic to IP or macrolide compounds.
Patients who are on cyclosporine, bosentan, or potassium sparing diuretic.
Patients with genetic diseases such as galactose intolerance, Lapp lactase deficiency, or glucose-galactose malabsorption.
Pregnant or lactating women.
Patients not willing to adhere to study procedures/treatments.

Annotated entities:
- Measurement: "Tacrolimus"
- Value: "2 ng/mg"
- Drug: "steroid"
- Measurement: "acute rejection test"
- Value: "positive"
- Procedure: "transplant"
- Qualifier: "liver"
- Condition: "allergic"
- Drug: "IP"
- Drug: "macrolide"
- Drug: "cyclosporine"
- Drug: "bosentan"
- Drug: "potassium sparing diuretic"
- Condition: "genetic diseases"
- Condition: "galactose intolerance"
- Condition: "Lapp lactase deficiency"
- Condition: "glucose-galactose malabsorption"
- Pregnancy_considerations: "Pregnant or lactating women"
- Post-eligibility: "Patients not willing to adhere to study procedures/treatments"